Clinical trial exclusion criterion:
irreversible status of primary disease

Annotated entities:
- Qualifier: "irreversible status"
- Condition: "primary disease"